Clinical trial exclusion criterion:
Disease needing 2 injections of Therasphere

Annotated entities:
- Context_Error: "Disease needing 2 injections of Therasphere"